Clinical trial exclusion criterion:
1. Left main disease (angiographically> 50%)

Annotated entities:
- Parsing_Error: "1."
- Condition: "Left main disease"
- Value: "> 50%"
- Context_Error: "(angiographically> 50%)"